ejection fraction < 40 % as assessed by 2D echocardiography

The above is a clinical trial inclusion criterion. Annotated with entity spans:
[Measurement: ejection fraction] [Value: < 40 %] as assessed by [Procedure: 2D echocardiography]